Clinical trial exclusion criterion:
Under other medicine treatment which may affect heart rate, like Non-dihydropyridine calcium channel blockers (NDHP-CCBs) or ivabradine for the last 2 weeks; Under Digoxin treatment [more than (>) 0.125 milligram (mg)].

Annotated entities:
- Drug: "Non-dihydropyridine calcium channel blockers"
- Drug: "NDHP-CCBs"
- Drug: "ivabradine"
- Temporal: "for the last 2 weeks"
- Drug: "Digoxin"
- Multiplier: "more than 0.125 milligram"
- Value: "> 0.125 mg"
- Non-query-able: "Under other medicine treatment which may affect heart rate"